一輛校車和卡車對撞後，引起爆炸和火燒車，車內一位6歲男孩被送到急診室，他的眉毛、鼻毛被燒焦，且臉和頸部有大約12% body surface area（BSA）的燒傷，他的聲音沙啞、呼吸快淺，血紅素氧飽合度為70%。此時下列處置何者第一優先？
A. 動脈氣體分析（arterial blood gas）
B. 胸部X光
C. 給予靜脈輸液
D. 實行氣管內管插管（endotracheal intubation）

正確答案：D. 實行氣管內管插管（endotracheal intubation）